What is the role of Tcf3 in the maintenance of pluripotency?

The maintenance of pluripotency in mouse embryonic stem cells relies on a transcriptional network that is fuelled by the activity of three transcription factors (Nanog, Oct4 and Sox2) and balanced by the repressive activity of Tcf3 . We found that down-regulation of Tlf3, a member of the Tcf/Lef family, represents a specific response to Wnt activation in ESCs . Further studies revealed that T cell factor 3 ( TCF3) is a potential downstream target of TERRA .